Patients who will not get surgical treatment for their endometrial cancer

The above is a clinical trial exclusion criterion. Annotated with entity spans:
Patients who will [Negation: not] get [Procedure: surgical treatment] for their [Condition: endometrial cancer]